Premorbid, ongoing major depression or psychosis, altered cognitive status

The above is a clinical trial exclusion criterion. Annotated with entity spans:
[Qualifier: Premorbid], [Temporal: ongoing] [Condition: major depression] or [Condition: psychosis], [Condition: altered cognitive status]